Clinical trial exclusion criterion:
Untreated hyperthyroidism, or hypothyroidism.

Annotated entities:
- Condition: "hyperthyroidism"
- Condition: "hypothyroidism"
- Qualifier: "Untreated"